Clinical trial exclusion criterion:
known sensitivity to components of the Truvada® formulation

Annotated entities:
- Condition: "sensitivity"
- Drug: "Truvada"